Clinical trial exclusion criterion:
failure to advance the IVUS catheter through the culprit lesion;

Entity relations:
- Has_qualifier("advance the IVUS catheter", "failure")
- multi("advance the IVUS catheter", "IVUS catheter")
- Has_qualifier("advance the IVUS catheter", "culprit lesion")